一位 50 歲李先生，過去有長期抽菸、酗酒、高血壓及糖尿病病史，主訴近幾個月爬到二樓就喘，且有下肢水腫的現象。量得病人血壓為 118/82 mmHg，脈搏 108/min 且不規則，X 光顯示心臟擴大，由以上初步病史，何者較不可能是李先生心臟擴大的鑑別診斷？
A. 擴張性心肌病變（dilated cardiomyopathy）
B. 酒精性心肌病變（alcoholic cardiomyopathy）
C. 缺血性心臟病（ischemic heart disease）
D. 高血壓性心臟病併嚴重主動脈瓣閉鎖不全（severe aortic regurgitation）

正確答案：D. 高血壓性心臟病併嚴重主動脈瓣閉鎖不全（severe aortic regurgitation）